clinical or pathological diagnosis of hepatocellular carcinoma (HCC) in previously untreated patients;

The above is a clinical trial inclusion criterion. Annotated with entity spans:
[Qualifier: clinical or pathological diagnosis] of [Condition: hepatocellular carcinoma] ([Condition: HCC]) in previously [Qualifier: untreated] patients;